A la hora de atender pacientes en situaciones graves y complejas, ¿cuáles son las dos actitudes esenciales para una buena relación médicopaciente?
1. Demostrar buenos conocimientos y asertividad.
2. Tenacidad y constancia.
3. Empatía y compasión.
4. Seguridad y destreza.

Respuesta correcta: 3. Empatía y compasión.